Cuando una persona comete el “error fundamental de atribución”, explica las conductas que realizan otros basándose exclusivamente en:
1. Las características personales.
2. La situación.
3. La cultura a la que pertenecen.
4. Las condiciones socio-económicas.
5. El azar.

Respuesta correcta: 1. Las características personales.